¿Cuál de las siguientes moléculas tiene geometría plana triangular?
1. BF3.
2. NH3.
3. AsH3.
4. XeO3.
5. ClF3.

Respuesta correcta: 1. BF3.